3. Subject signs and dates a written informed consent form (ICF) and indicates an understanding of the study procedures.

The above is a clinical trial inclusion criterion. Annotated with entity spans:
[Post-eligibility: 3. Subject signs and dates a written informed consent form (ICF) and indicates an understanding of the study procedures.]